Clinical trial exclusion criterion:
Participation in other drug clinical trial within the last 4 weeks;

Annotated entities:
- Competing_trial: "Participation in other drug clinical trial within the last 4 weeks;"